Clinical trial inclusion criterion:
Patient is receiving chronic oral anticoagulation therapy (i.e., vitamin K antagonist, direct thrombin inhibitor, Factor Xa inhibitor)

Annotated entities:
- Procedure: "oral anticoagulation therapy"
- Multiplier: "chronic"
- Drug: "vitamin K antagonist"
- Drug: "direct thrombin inhibitor"
- Drug: "Factor Xa inhibitor"